Clinical trial exclusion criterion:
Allergy to study medications

Annotated entities:
- Condition: "Allergy"
- Drug: "study medications"